Serum glutamic oxaloacetic transaminase (SGOT) and serum glutamate pyruvate transaminase (SGPT) < 2.5 x upper limit of normal for patients without liver metastases OR SGOT and SGPT < 5 x upper limit of normal for patients with liver metastases

The above is a clinical trial inclusion criterion. Annotated with entity spans:
[Measurement: Serum glutamic oxaloacetic transaminase] ([Measurement: SGOT]) and [Measurement: serum glutamate pyruvate transaminase] ([Measurement: SGPT]) [Value: < 2.5 x upper limit of normal] for patients [Negation: without] [Condition: liver metastases] OR [Measurement: SGOT] and [Measurement: SGPT] [Value: < 5 x upper limit of normal] for patients with [Condition: liver metastases]